La hiperprosexia se refiere a:
1. Predisposición a percibir y responder excluyendo los aspectos irrelevantes.
2. Escudriñamiento continuo del ambiente en busca de determinadas señales o indicios.
3. Procesamiento que requiere atención consciente.
4. Distraibilidad e inestabilidad atencional.

Respuesta correcta: 4. Distraibilidad e inestabilidad atencional.